Clinical trial exclusion criterion:
Diagnosis of a primary or secondary HA disorder other than PTHA

Entity relations:
- Has_negation("PTHA", "other than")
- AND("HA disorder", "PTHA")
- Has_qualifier("HA disorder", "primary")
- OR("primary", "secondary")